Hypersensitivity or allergic reaction to regadenoson or adenosine

The above is a clinical trial exclusion criterion. Annotated with entity spans:
[Condition: Hypersensitivity] or [Condition: allergic] reaction to [Drug: regadenoson] or [Drug: adenosine]